Clinical trial exclusion criterion:
multiple injuries (polytrauma patients)

Entity relations:
- Subsumes("multiple injuries", "polytrauma")